La cromatografía de afinidad se caracteriza porque:
1. Es una modalidad de la cromatografía de gases.
2. Es similar a la cromatografía en papel.
3. Es un proceso de separación basado en las interacciones muy selectivas o específicas que existen entre las macromoléculas biológicas.
4. Es una técnica de separación de compuestos en función de su peso molecular.
5. Es una variante de cromatografía que emplean fases estacionarias relativamente no polares y disolventes más polares, en contraste con la cromatografía en fase normal.

Respuesta correcta: 3. Es un proceso de separación basado en las interacciones muy selectivas o específicas que existen entre las macromoléculas biológicas.